Clinical trial exclusion criterion:
Hypersensitivity to morphine, naltrexone.

Entity relations:
- AND("Hypersensitivity", "morphine")
- OR("morphine", "naltrexone")